下列那一種器官對於由乙醇引起的病變程度最為重要？
A. 胰臟
B. 心臟
C. 肺臟
D. 肝臟

正確答案：D. 肝臟